¿Cuál de los siguientes parámetros cromatográficos nos informa sobre la eficacia de la separación cromatográfica?:
1. Tiempo de retención.
2. Tiempo muerto.
3. Factor de capacidad.
4. Número de platos teóricos.

Respuesta correcta: 4. Número de platos teóricos.